Clinical trial inclusion criterion:
enter the operating room by himself without parents

Annotated entities:
- Non-query-able: "enter the operating room by himself without parents"